一位 52 歲男性，原有糖尿病、高血壓及血脂異常，因心絞痛接受心導管檢查，其檢查結果顯示有冠狀動脈左主幹病變（left main lesion），約有 60% 狹窄。下列何種治療建議最為適當？
A. 加強使用藥物治療
B. 施行心導管氣球擴張術
C. 施行心導管氣球擴張術並合併使用裸金屬支架（bare-metal stent）
D. 進行冠狀動脈繞道手術

正確答案：D. 進行冠狀動脈繞道手術